Other acquired or inherited causes of liver disease: alcoholic liver disease, obesity induced liver disease, drug related liver disease, auto-immune hepatitis, hemochromatosis, Wilson's disease or alpha-1 antitrypsin deficiency

The above is a clinical trial exclusion criterion. Annotated with entity spans:
Other [Qualifier: acquired] or [Qualifier: inherited] causes of [Condition: liver disease]: [Condition: alcoholic liver disease], [Condition: obesity induced liver disease], [Condition: drug related liver disease], [Condition: auto-immune hepatitis], [Condition: hemochromatosis], [Condition: Wilson's disease] or [Condition: alpha-1 antitrypsin deficiency]